下列何者為總腓神經（common peroneal nerve）受傷時會出現的現象？
A. 腳掌外翻
B. 足背彎曲（dorsiflex）
C. 鈎狀外翻足（calcaneovalgus）
D. 垂足（footdrop）

正確答案：D. 垂足（footdrop）